Clinical trial exclusion criterion:
Pregnancy or breast feeding

Annotated entities:
- Condition: "Pregnancy"
- Observation: "breast feeding"